Clinical trial exclusion criterion:
Claustrophobic patient unable to undergo the examination

Annotated entities:
- Condition: "Claustrophobic"
- Negation: "unable"
- Procedure: "examination"